Clinical trial exclusion criterion:
History of significant head trauma, seizure disorder, or mental retardation

Entity relations:
- AND("History", "head trauma")
- OR("head trauma", "seizure disorder", "mental retardation")